Participation in a CHF training program.

The above is a clinical trial exclusion criterion. Annotated with entity spans:
[Non-query-able: Participation in a CHF training program.]